Clinical trial exclusion criterion:
Previous pars plana vitrectomy in the study eye

Entity relations:
- Has_qualifier("pars plana vitrectomy", "in the study eye")
- Has_temporal("pars plana vitrectomy", "Previous")